外傷死亡之病人，在外傷發生後那一個時段，死亡人數最多？
A. 0～15 minutes
B. 1～24 hours
C. 3～7 days
D. 7～30 days

正確答案：A. 0～15 minutes